Patients who plucked the upper eyebrow margin

The above is a clinical trial exclusion criterion. Annotated with entity spans:
Patients who [Condition: plucked the upper eyebrow margin]